Clinical trial exclusion criterion:
History of psychotic disorder or manic episode diagnosed by MINI-KID

Annotated entities:
- Temporal: "History"
- Condition: "psychotic disorder"
- Condition: "manic episode"
- Procedure: "MINI-KID"